Clinical trial exclusion criterion:
Of childbearing potential with a positive serum pregnancy test, pregnant or lactating

Annotated entities:
- Person: "childbearing potential"
- Value: "positive"
- Measurement: "serum pregnancy test"
- Condition: "pregnant"
- Condition: "lactating"